Clinical trial exclusion criterion:
(relative) Contraindications for photodynamic treatment (pregnancy, porphyria, severely disturbed liver function). Pregnancy will not be routinely tested in female patients, but the possibility of pregnancy will be discussed during screening

Entity relations:
- Has_qualifier("disturbed liver function", "severely")
- AND("Contraindications", "photodynamic treatment")
- Subsumes("Contraindications", "pregnancy")
- OR("pregnancy", "porphyria", "disturbed liver function")